下列何者是造成傷口攣縮（wound contracture）的主要細胞？
A. 肌纖維母細胞（myofibroblast）
B. B-淋巴球（B-lymphocyte）
C. T-淋巴球（T-lymphocyte）
D. 巨噬細胞（macrophage）

正確答案：A. 肌纖維母細胞（myofibroblast）